Participants who cannot swallow investigational products

The above is a clinical trial exclusion criterion. Annotated with entity spans:
Participants who [Observation: cannot swallow] [Drug: investigational products]